7. Pulmonary hypertension due to:

The above is a clinical trial exclusion criterion. Annotated with entity spans:
[Parsing_Error: 7.] [Parsing_Error: Pulmonary hypertension due to:]